Los cloruro de ácido son los derivados de ácido:
1. Menos reactivos.
2. Más reactivos.
3. Igual de reactivos que los demás.
4. Que peor se transforman.

Respuesta correcta: 2. Más reactivos.